Clinical trial exclusion criterion:
HBA1c more than 108 mmol/l

Entity relations:
- Has_value("HBA1c", "more than 108 mmol/l")